1. Males and females ≥ 18 years old.

The above is a clinical trial inclusion criterion. Annotated with entity spans:
[Parsing_Error: 1.] [Person: Males] [Grammar_Error: and] [Person: females] [Value: ≥ 18 years old].